肝癌的治療可以經由血管打入藥物造成栓塞以殺死腫瘤細胞，臨床上最適合的路徑是把藥物打入：
A. 肝靜脈
B. 主動脈
C. 門靜脈
D. 肝動脈

正確答案：D. 肝動脈